下列關於春季角結膜炎（vernal keratoconjunctivitis）的敘述，何者錯誤？
A. 好發在 7 歲左右的小男孩
B. 在角膜輪部可見 Horner-Trantas dots
C. 乳頭狀肥厚（papillary hypertrophy）好發於上眼瞼板（superior tarsus）
D. 盾狀潰瘍（shield ulcer）是細菌感染所造成

正確答案：D. 盾狀潰瘍（shield ulcer）是細菌感染所造成